Clinical trial inclusion criterion:
Life expectancy ≥ 3 months

Entity relations:
- Has_value("Life expectancy", "≥ 3 months")